Clinical trial exclusion criterion:
Serum potassium < 3.5 or > 5.1 mEq/L

Entity relations:
- Has_value("Serum potassium", "< 3.5")
- OR("< 3.5", "> 5.1 mEq/L")